Clinical trial exclusion criterion:
H. Pylori eradication within 2 months before study entry.

Annotated entities:
- Procedure: "H. Pylori eradication"
- Temporal: "within 2 months before study entry"
- Reference_point: "study entry"